Clinical trial inclusion criteria:
Confirmed diagnosis of non-Burkitt B-lineage ALL
1 to 17 years of age (before 18th birthday)
Renal function within normal range for age
Liver function within normal range for age
Able to participate in the full 2 years of treatment

Annotated entities:
- Condition: "non-Burkitt B-lineage ALL"
- Qualifier: "Confirmed"
- Value: "1 to 17 years"
- Person: "age"
- Measurement: "Renal function"
- Value: "within normal range for age"
- Measurement: "Liver function"
- Value: "within normal range for age"
- Observation: "Able to participate"
- Procedure: "treatment"
- Multiplier: "full 2 years"